¿Cuál de las siguientes respuestas es cierta respecto a les moléculas de HLA?
1. Son proteínas nucleares muy polimórficas.
2. Se dividen en moléculas de clase IgG, IgA e IgM.
3. Unen péptidos y los presentan en la superficie celular.
4. Interaccionan con las citocinas para modular la respuesta inmune.
5. Son monomórficas.

Respuesta correcta: 3. Unen péptidos y los presentan en la superficie celular.